pregnancy or planning to become pregnant in the next 2 years,

The above is a clinical trial exclusion criterion. Annotated with entity spans:
[Condition: pregnancy] or [Mood: planning to become] [Condition: pregnant] [Temporal: in the next 2 years],